Hypertension (high blood pressure) that can not be controlled by drugs;

The above is a clinical trial exclusion criterion. Annotated with entity spans:
[Condition: Hypertension] ([Condition: high blood pressure]) that can [Negation: not] be [Qualifier: controlled by drugs];